Clinical trial exclusion criterion:
Helicobacter infected patients who have not been treated for eradication (recruitment if negative in re-examination after treatment).

Entity relations:
- Has_negation("treated for eradication", "not")
- AND("Helicobacter infected", "treated for eradication")